Clinical trial exclusion criterion:
pre-operative opioid analgesics

Annotated entities:
- Temporal: "pre-operative"
- Drug: "opioid analgesics"